=18 years old, men or post-menopausal women (women with no periods for 12 months or more, or those who have had a surgical menopause)

The above is a clinical trial inclusion criterion. Annotated with entity spans:
[Value: =18] [Person: years old], [Person: men] or [Condition: post-menopausal] [Person: women] (women with [Condition: no periods] [Temporal: for 12 months or more], or those who have had a [Procedure: surgical] [Condition: menopause])